Which neuropsychiatric disorders are associated with 16p13.11 genomic copy number variants?

schizophrenia, autism, mental retardation, ADHD and epilepsy